Clinical trial exclusion criterion:
Subject has renal dysfunction with glomerular filtration rate < 60 ml / min.

Entity relations:
- AND("renal dysfunction", "glomerular filtration rate")
- Has_value("glomerular filtration rate", "< 60 ml / min")